Clinical trial inclusion criterion:
Female participants must use a contraceptive method.

Entity relations:
- AND("Female", "contraceptive method")